Describe ReactomeGSA

ReactiveomeGSA is a novel resource for comparative pathway analyses of multi-omics datasets.